2歲女童因跌倒撞到臉頰後口腔滲血不止被送到急診室。女童自小斷斷續續就會有口腔滲血或流鼻血情形出現，但都不是很嚴重，另外注射疫苗時要比其他人較長的時間才會止血。病人沒有瘀血、血腫情形，父母兩邊家族都沒有親戚有出血性的疾病。病人血液檢查血紅素、血球容積比、白血球數目、血小板數目、血漿凝血酶原時間（PT）在正常範圍內，活化部分凝血活酶時間（aPTT）延長為 37.2秒（正常為24.4-33.2秒）。最可能造成病人口腔滲血不止的原因為：
A. 先天性von Willebrand因子減少
B. 第八凝血因子缺乏
C. 葡萄糖六磷酸去氫酵素（glucose 6-phosphate dehydrogenase）缺乏
D. 免疫複合體（immune complex）堆積引起血管內皮傷害

正確答案：A. 先天性von Willebrand因子減少